Clinical trial exclusion criterion:
Patients will be excluded if they have had exposure to a total daily dose of MET 1000 mg bid for at least 2 weeks in the past 3 months;

Annotated entities:
- Drug: "MET"
- Multiplier: "1000 mg bid"
- Temporal: "at least 2 weeks in the past 3 months"